Clinical trial exclusion criterion:
Has or is suspected of having an allergy to study treatments or its/their excipients, to opioids/opiates, muscle relaxants or their excipients, or other medication(s) used during general anesthesia.

Entity relations:
- Has_qualifier("medication", "other")
- Has_temporal("medication", "during general anesthesia")
- AND("allergy", "study treatments")
- AND("allergy", "general anesthesia")
- OR("study treatments", "excipients", "opioids", "opiates", "medication", "excipients", "muscle relaxants")